Clinical trial exclusion criterion:
Subject with other known infectious cause of abdominal symptoms.

Annotated entities:
- Context_Error: "other known infectious cause of abdominal symptoms"